攜鈣素（Calmodulin）不具有下列那種特性？
A. 與鈣離子結合會改變其構型
B. 含有一個兩性（amphipathic）的β層（β-sheet）能與標靶蛋白質（target protein）相互作用
C. 調節許多蛋白激酶（protein kinase）的活性
D. 以螺旋-環-螺旋結構（helix-loop-helix motif）與鈣離子結合

正確答案：B. 含有一個兩性（amphipathic）的β層（β-sheet）能與標靶蛋白質（target protein）相互作用